Clinical trial inclusion criterion:
Modified Lanza Score grade 0-1 measured by upper gastrointestinal endoscopy

Entity relations:
- Has_value("Modified Lanza Score grade", "0-1")
- AND("upper gastrointestinal endoscopy", "Modified Lanza Score grade")